Pregnant or breast-feeding

The above is a clinical trial exclusion criterion. Annotated with entity spans:
[Condition: Pregnant] or [Condition: breast-feeding]